Where is the klotho protein primarily expressed in the body

The klotho protein is primarily expressed in the lungs, kidney, lens, cerebellum, trpc6, renal cells and the brain.